Clinical trial exclusion criterion:
2. AST or ALT > 3 × ULN

Entity relations:
- Has_value("ALT", "> 3 × ULN")
- Has_value("AST", "> 3 × ULN")
- OR("AST", "ALT")